Clinical trial inclusion criterion:
Negative HIV serology during screening period.

Entity relations:
- Has_index("during screening period", "screening period")
- Has_value("HIV serology", "Negative")
- Has_temporal("HIV serology", "during screening period")